Clinical trial exclusion criterion:
Organic diseases of the digestive system (gastro-oesophageal reflux disease (GERD), ulcer, chronic pancreatitis, cholelithiasis, fatty liver disease, hepatitis, cirrhosis of liver, etc.) .

Entity relations:
- Has_qualifier("Organic diseases", "digestive system")
- Subsumes("Organic diseases", "gastro-oesophageal reflux disease (GERD)")
- OR("gastro-oesophageal reflux disease (GERD)", "ulcer", "chronic pancreatitis", "cholelithiasis", "fatty liver disease", "hepatitis", "cirrhosis of liver")